Clinical trial inclusion criterion:
diagnosed with PD by a neurologist (Fahn and Elton, 1987);

Annotated entities:
- Condition: "PD"
- Qualifier: "by a neurologist"
- Non-query-able: "by a neurologist"